一位 58 歲女性糖尿病病人，因跌落水溝造成右小腿撕裂傷，傷口曾浸於水溝水中，下列敘述何者是此傷口最適當的治療方法？
A. 以生理食鹽水沖洗後縫合傷口
B. 清創（débridement）後縫合傷口
C. 清創後縫合傷口，再給予局部抗生素治療
D. 對傷口重複清創，給予局部或全身性抗生素治療，待控制住感染後再行縫合傷口或植皮

正確答案：D. 對傷口重複清創，給予局部或全身性抗生素治療，待控制住感染後再行縫合傷口或植皮